Clinical trial exclusion criterion:
Other protocol-defined inclusion/exclusion criteria may apply

Entity relations:
- multi("Other protocol-defined inclusion/exclusion criteria may apply", "Other")
- multi("Other protocol-defined inclusion/exclusion criteria may apply", "protocol-defined")